What is the activity of a Oligosaccharyltransferases ?

oligosaccharyltransferases (OSTs), which catalyze the attachment of glycans to specific amino acid residues in target proteins